El almidón es un indicador específico utilizado para indicar el punto final en las valoraciones redox con:
1. Cerio.
2. Yodo.
3. Bromo.
4. Permanganato.
5. Dicromato.

Respuesta correcta: 2. Yodo.